Clinical trial exclusion criterion:
Immunosuppressive therapy before 6 months of study initiation

Entity relations:
- Has_index("before 6 months of study initiation", "study initiation")
- Has_temporal("Immunosuppressive therapy", "before 6 months of study initiation")